小腦的血管母細胞瘤（hemangioblastoma）最可能是下列那一個疾病或症候群的一部分？
A. 第 I 型神經纖維瘤病（neurofibromatosis type 1）
B. 第 II 型神經纖維瘤病（neurofibromatosis type 2）
C. von Hippel-Lindau 病
D. 結節性硬化（tuberous sclerosis）

正確答案：C. von Hippel-Lindau 病